下列那一種疾病最常合併恐慌發作？
A. 甲狀腺功能過高
B. 二尖瓣脫垂
C. 心肌病變（cardiomyopathy）
D. 慢性阻塞性肺病（chronic obstructive pulmonary disease）

正確答案：C. 心肌病變（cardiomyopathy）